下列何種酵素不直接參與大腸桿菌的methyl-directed mismatch repair？
A. DNA glycosylase
B. DNA helicaseⅡ
C. DNA ligase
D. DNA polymeraseⅢ

正確答案：A. DNA glycosylase